HCV naive

The above is a clinical trial inclusion criterion. Annotated with entity spans:
[Condition: HCV naive]